有關二羥基吡啶受器（dihydropyridine receptor, DHPR）的敘述，下列何者錯誤？
A. 該受器屬於骨骼肌肉纖維的細胞膜蛋白
B. 鈣離子由肌漿網流入細胞質內必須通過該受器
C. DHPR 可調控電壓門控性鈣離子通道（voltage-gated calcium ion channel）
D. 開啟阿諾鹼受體（ryanodine receptor）主要是藉由 DHPR 在結構上的構象改變（conformational change）

正確答案：B. 鈣離子由肌漿網流入細胞質內必須通過該受器